Clinical trial inclusion criterion:
Patients without functional impairment of organs: liver function: total bilirubin, AST, ALT, alfa-GT and alkaline phosphatase less than 3 times the upper limit of normal laboratory renal function: serum creatinine < 2 mg/dL or clearance creatinine > 30 ml/min (except renal function attributable to LAL) cardiac function (Appendix B) normal: ventricular EF > 50%, absence of severe chronic respiratory disease. In the event that alterations are secondary to the disease is at the discretion of the investigator to determine if the patient can be included in the trial.

Annotated entities:
- Condition: "functional impairment of organs"
- Negation: "without"
- Measurement: "total bilirubin"
- Measurement: "AST"
- Measurement: "ALT"
- Measurement: "alfa-GT"
- Measurement: "alkaline phosphatase"
- Value: "less than 3 times the upper limit of normal"
- Measurement: "serum creatinine"
- Value: "< 2 mg/dL"
- Measurement: "clearance creatinine"
- Value: "> 30 ml/min"
- Non-representable: "(except renal function attributable to LAL)"
- Measurement: "cardiac function"
- Value: "normal"
- Measurement: "ventricular EF"
- Value: "> 50%"
- Negation: "absence of"
- Condition: "severe chronic respiratory disease"
- Non-representable: "In the event that alterations are secondary to the disease is at the discretion of the investigator to determine if the patient can be included in the trial"